依下表數據計算下列各指標，下列何者錯誤？    疾病真實狀況  有 
 無 
 有 
 68 
 6 
 無 
 12 
 114 
 疾病診斷結果74 Total
 126 
 	 	Total 
 80 
 120 	200
A. 敏感度為 85%
B. 特異度為 95%
C. 陽性預測值為 85%
D. 陰性預測值為 90.5%

正確答案：C. 陽性預測值為 85%